Are known to have protruding left ventricular thrombus or mechanical aortic and mitral valves

The above is a clinical trial exclusion criterion. Annotated with entity spans:
Are known to have protruding [Condition: left ventricular thrombus] or [Device: mechanical aortic] and mitral valves